Clinical trial inclusion criterion:
Subject understands the investigational nature of the study and provides written, informed consent.

Annotated entities:
- Post-eligibility: "Subject understands the investigational nature of the study and provides written, informed consent."